Clinical trial exclusion criterion:
Previous ocular surgery history or ocular trauma that may confound the results of the study;

Annotated entities:
- Procedure: "ocular surgery"
- Temporal: "Previous"
- Condition: "ocular trauma"
- Qualifier: "may confound the results of the study"